關於嚴重 diabetic gastroparesis 的手術治療方式，下列何者最不適當？
A. 胃切除
B. 胃造口
C. 空腸造口
D. 胰臟移植

正確答案：A. 胃切除